An interval of < 6 months from the completion of cytotoxic chemotherapy in the neo-adjuvant or adjuvant setting until the time of metastatic diagnosis.

The above is a clinical trial exclusion criterion. Annotated with entity spans:
An interval of [Value: < 6 months] from the completion of [Procedure: cytotoxic chemotherapy] in the [Qualifier: neo-adjuvant] or [Qualifier: adjuvant setting] until the time of [Condition: metastatic diagnosis].